Clinical trial inclusion criterion:
Adult outpatients (18 years or older)

Entity relations:
- Has_value("Adult", "18 years or older")